La reacción en cadena de la polimerasa (PCR) engloba tres procesos. Seleccionar el orden de secuencia:
1. Extensión → Fusión → Desnaturalización.
2. Fusión → Desnaturalización → Extensión.
3. Desnaturalización → Fusión → Extensión.
4. Desnaturalización → Extensión → Fusión.
5. Extensión → Desnaturalización → Fusión.

Respuesta correcta: 3. Desnaturalización → Fusión → Extensión.